El ciclo biológico de Trichinella spiralis es de tipo:
1. Estenoxeno.
2. Facultativo.
3. Triheteroxeno.
4. Autoheteroxeno.
5. Heterogónico.

Respuesta correcta: 4. Autoheteroxeno.